Clinical trial inclusion criterion:
Biopsy-proven LN Class III/IV±V (ISN/RPS 2003), with biopsy performed within 12 weeks of randomization.

Annotated entities:
- Condition: "LN"
- Qualifier: "Class III/IV±V"
- Procedure: "biopsy"
- Temporal: "within 12 weeks"